Clinical trial inclusion criterion:
PICU admission

Entity relations:
- AND("admission", "PICU")